Clinical trial exclusion criterion:
3. Diagnosis of chronic myelogenous leukemia (CML) in blast crisis

Annotated entities:
- Condition: "chronic myelogenous leukemia (CML)"
- Condition: "blast crisis"